Eumenorrheic normo-gonadotropic women

The above is a clinical trial inclusion criterion. Annotated with entity spans:
[Condition: Eumenorrheic] [Condition: normo-gonadotropic] [Person: women]